Clinical trial exclusion criterion:
Exposure to sun or UV radiations, 15 days before the patch testing.

Annotated entities:
- Condition: "Exposure to sun"
- Condition: "Exposure to UV radiations"
- Temporal: "15 days before the patch testing"
- Reference_point: "the patch testing"